Clinical trial exclusion criterion:
Has any systemic inflammatory condition, including psoriatic arthritis, active Lyme disease, systemic lupus erythematosus, infectious arthritis, vasculitis, parvovirus infection, rheumatoid arthritis, active uveitis, or active IBD

Entity relations:
- Has_qualifier("Lyme disease", "active")
- Subsumes("inflammatory condition", "psoriatic arthritis")
- OR("psoriatic arthritis", "active IBD", "rheumatoid arthritis", "parvovirus infection", "vasculitis", "infectious arthritis", "systemic lupus erythematosus", "Lyme disease", "active uveitis")